Prior history of treatment failure to two previous SSRI trials at appropriate doses and duration

The above is a clinical trial exclusion criterion. Annotated with entity spans:
[Non-query-able: Prior history of treatment failure to two previous SSRI trials at appropriate doses and duration]